¿Cuál de los siguientes factores influye en la tasa de filtración glomerular (TFG)?:
1. La presión arterial.
2. El flujo sanguíneo renal.
3. La autorregulación por respuestas miogénicas y retroalimentación tubuloglomerular.
4. Las hormonas como la Angiotensina II y las neuronas del sistema nervioso simpático.
5. Todas son correctas.

Respuesta correcta: 5. Todas son correctas.